Bleeding diathesis, thrombocytopenia, or use of anticoagulants that would contraindicate lumbar puncture.

The above is a clinical trial exclusion criterion. Annotated with entity spans:
[Condition: Bleeding diathesis], [Condition: thrombocytopenia], or use of [Drug: anticoagulants] that would [Condition: contraindicate] [Procedure: lumbar puncture].